Major surgery within 14 days before enrollment.

The above is a clinical trial exclusion criterion. Annotated with entity spans:
[Procedure: Major surgery] [Temporal: within 14 days before enrollment].